下列有關慢性心房纖維性顫動（permanent atrial fibrillation）的敍述，何者錯誤？
A. 為最常見的慢性心律不整
B. 75歲，女性，糖尿病患，應使用抗凝血劑治療
C. 25歲，男性，風濕性心臟病合併僧帽瓣狹窄，不必使用抗凝血劑治療
D. 可考慮只做心律速度的管控（rate control）

正確答案：C. 25歲，男性，風濕性心臟病合併僧帽瓣狹窄，不必使用抗凝血劑治療